Hemoglobin >= 9 g/dL

The above is a clinical trial inclusion criterion. Annotated with entity spans:
[Measurement: Hemoglobin] [Value: >= 9 g/dL]